Bleeding tendency or coagulopathy

The above is a clinical trial exclusion criterion. Annotated with entity spans:
[Condition: Bleeding tendency] or [Condition: coagulopathy]